一位 55 歲男性病患，因聽力突然喪失（sudden hearing loss）而至急診求治，下列敘述何者錯誤？
A. 聽力突然喪失的發生率隨年齡增加而上升，且無性別上的差異
B. 病毒感染是造成聽力突然喪失的原因之一
C. 外耳道發炎不會造成聽力突然喪失
D. 耳膜破裂是外傷性聽力突然喪失的常見原因

正確答案：C. 外耳道發炎不會造成聽力突然喪失